Malignancies or other comorbid conditions with life expectancy less than 12 months or that may result in protocol noncompliance

The above is a clinical trial exclusion criterion. Annotated with entity spans:
[Condition: Malignancies] or [Qualifier: other] [Condition: comorbid conditions] with [Observation: life expectancy] [Value: less than 12 months] or that [Mood: may] result in [Observation: protocol noncompliance]